Clinical trial exclusion criterion:
Active CNS or epiduraltumor

Entity relations:
- OR("CNS tumor", "epiduraltumor")